What is the role of the IRE1a-XBP1 pathway?

The IRE1a-XBP1 pathway is a conserved adaptive mediator of the unfolded protein response, playing an important role in the regulation of cell proliferation and differentiation.